根據美國神經肌肉電學診斷學會（AANEM , AMBEM）之適應症指引，肌電診斷檢查（electrodiagnosis）對於下列那一種病患較無診斷幫助？
A. 失智症（dementia）
B. 皮肌炎（dermatomyositis）
C. Guillain-Barré 症候群
D. 肘管症候群（cubital tunnel syndrome）

正確答案：A. 失智症（dementia）